Clinical trial exclusion criterion:
History of intolerance to LMWHs during HD

Entity relations:
- multi("during HD", "HD")
- Has_temporal("LMWHs", "during HD")
- AND("intolerance", "LMWHs")